Clinical trial exclusion criterion:
Chronic HBV/HIV infection

Entity relations:
- OR("HIV infection Chronic", "infection Chronic HBV")